關於胎兒心臟系統的敘述，何者錯誤？
A. 右心房約有三分之一血液經卵圓孔到左心房
B. 肺靜脈由肺臟帶回充氧血至左心房
C. 動脈導管連通主動脈與肺動脈
D. 靜脈導管在下腔靜脈與臍靜脈間

正確答案：B. 肺靜脈由肺臟帶回充氧血至左心房